Clinical trial exclusion criterion:
Past or planned surgery affecting gastric acid secretion.

Annotated entities:
- Qualifier: "affecting gastric acid secretion"
- Procedure: "surgery"
- Mood: "planned"
- Temporal: "Past"